Clinical trial inclusion criterion:
4. Subjects in Phase 2 must have disease amenable to biopsy and must be willing to undergo pre- and post-treatment tumor biopsies. Optional for Phase 1.

Annotated entities:
- Parsing_Error: "4."
- Condition: "disease amenable to biopsy"
- Subjective_judgement: "disease amenable to biopsy"
- Undefined_semantics: "disease amenable to biopsy"
- Non-query-able: "willing to undergo pre- and post-treatment tumor biopsies"
- Post-eligibility: "willing to undergo pre- and post-treatment tumor biopsies"
- Parsing_Error: "Optional for Phase 1."